一位 6 歲小女孩，初經來潮，最可能為何？
A. Turner's syndrome
B. Kallmann's syndrome
C. Isolated gonadotropin deficiency
D. 11-β-Hydroxylase deficiency

正確答案：D. 11-β-Hydroxylase deficiency